Clinical trial inclusion criterion:
· creatinine ≤ 1.5 x ULN

Annotated entities:
- Measurement: "creatinine"
- Value: "≤ 1.5 x ULN"